Clinical trial inclusion criterion:
MDD Cohort: Meet DSM-5 criteria for Major Depressive Disorder by structured interview (MINI-KID); CDRS-R score >40; Failure to achieve remission with at least 1 adequate prior antidepressant trial (e.g. SSRI, SNRI, or TCA), meaning at least 8 weeks at therapeutic dosing, including at least 4 weeks of stable dosing.

Annotated entities:
- Observation: "MDD Cohort"
- Qualifier: "DSM-5 criteria"
- Condition: "Major Depressive Disorder"
- Procedure: "structured interview"
- Procedure: "MINI-KID"
- Measurement: "CDRS-R score"
- Value: ">40"
- Negation: "Failure"
- Condition: "remission"
- Multiplier: "at least 1"
- Qualifier: "adequate"
- Procedure: "antidepressant trial"
- Drug: "SSRI"
- Temporal: "prior"
- Drug: "SNRI"
- Drug: "TCA"
- Multiplier: "at least 8 weeks"
- Procedure: "therapeutic dosing"
- Multiplier: "at least 4 weeks"
- Procedure: "stable dosing"
- Drug: "antidepressant"